下列何者具有5'端至3'端的核酸外切酶（exonuclease）活性？
A. primase
B. DNA聚合酶Ⅰ型（DNA polymeraseⅠ）
C. DNA聚合酶Ⅲ型（DNA polymeraseⅢ）
D. DNA促旋酶（DNA gyrase）

正確答案：B. DNA聚合酶Ⅰ型（DNA polymeraseⅠ）